下列何者出現在腦幹的interpeduncular fossa中？
A. 滑車神經（trochlear nerve）
B. 動眼神經（oculomotor nerve）
C. 基底動脈（basilar artery）
D. 腦下垂體（pituitary gland）

正確答案：B. 動眼神經（oculomotor nerve）